F步行通過斑馬線之際，遭他人駕車撞擊昏迷，於加護病房接受照顧1個月後，身體逐漸康復，然而F出現失眠、夢魘、焦慮、憂鬱、不敢過馬路、逃避任何關於車禍的話題或畫面，經精神科專科醫師P診斷為「創傷後壓力症候群」（Post-traumatic stress disorder），接受治療達1年之久。F對於肇事者提出民事賠償訴訟，法院若委託P為F進行鑑定其心理創傷之程度，則下列何者最為恰當？
A. P應接受法院委託鑑定，因為P診療F已有1年之久，最了解F
B. P應接受法院委託鑑定，因為P診療F已有1年之久，F最信任P，願意配合鑑定
C. P應拒絕法院之委託鑑定，因為F有可能因此喪失恢復健康之動機
D. P應拒絕法院之委託鑑定，因為P會有照顧F及公正鑑定之角色衝突

正確答案：D. P應拒絕法院之委託鑑定，因為P會有照顧F及公正鑑定之角色衝突